Una de las siguientes opciones está contraindicada como recomendación aplicable cuando se debe dar una noticia negativa a un paciente:
1. Dar tiempo para que el paciente responda.
2. Permitir que se realicen preguntas.
3. Minimizar y tratar de atenuar las emociones que muestre el individuo.
4. Proporcionar toda la información de forma parcelada, por partes.

Respuesta correcta: 3. Minimizar y tratar de atenuar las emociones que muestre el individuo.